一位中年婦女無高血壓、冠心症、高血脂症或糖尿病等病史，主訴兩天前眩暈發作。尤其與起床、躺下與左側臥姿態等動作有關，反覆十幾次，每次約持續數秒鐘，沒有聽力障礙與耳鳴。下列何者為最可能之診斷？
A. 梅尼爾氏病（Meniere's disease）
B. 良性陣發性位置性眩暈（benign paroxysmal positional vertigo）
C. 前庭神經炎（vestibular neuritis）
D. 椎骨底動脈循環不全症（vertebro-basilar artery insufficiency）

正確答案：B. 良性陣發性位置性眩暈（benign paroxysmal positional vertigo）